Clinical trial exclusion criteria:
A known allergy to Celecoxib, aspirin or another NSAID.
Active peptic ulceration or gastrointestinal bleeding.
Inflammatory bowel disease.
Congestive heart failure (NYHA II-IV).
Established ischemic heart disease, peripheral arterial disease and/or cerebrovascular disease.
History of neurologic deficit.
Known hepatic or renal impairment.
Pregnancy.
Breast-feeding.
Post-hysterectomy.
Bleeding disorders.
Drug abuse.
Cervical and vaginal infection.

Annotated entities:
- Condition: "allergy"
- Drug: "Celecoxib"
- Drug: "aspirin"
- Drug: "NSAID"
- Qualifier: "another"
- Temporal: "Active"
- Condition: "peptic ulceration"
- Condition: "gastrointestinal bleeding"
- Condition: "Inflammatory bowel disease"
- Condition: "Congestive heart failure"
- Measurement: "NYHA"
- Value: "II-IV"
- Condition: "ischemic heart disease"
- Condition: "peripheral arterial disease"
- Condition: "cerebrovascular disease"
- Condition: "neurologic deficit"
- Temporal: "History"
- Condition: "renal impairment"
- Condition: "hepatic impairment"
- Condition: "Pregnancy"
- Observation: "Breast-feeding"
- Procedure: "hysterectomy"
- Temporal: "Post"
- Condition: "Bleeding disorders"
- Condition: "Drug abuse"
- Condition: "Cervical infection"
- Condition: "vaginal infection"